Un modulador alostérico influye en la actividad de una enzima:
1. Compitiendo con un sustrato por el sitio catalítico.
2. Uniéndose a la enzima en un sitio distinto al sitio catalítico.
3. Cambiando la naturaleza del producto formado.
4. Cambiando la especificidad de la enzima por el sustrato.
5. Desnaturalizando la enzima.

Respuesta correcta: 2. Uniéndose a la enzima en un sitio distinto al sitio catalítico.